一位新生兒的血液篩檢發現有白胺酸（leucine）、異白胺酸（isoleucine）及纈胺酸（valine）的堆積，懷疑是楓糖漿尿症（maple syrup urine disease）的患者，必須終身作嚴格的飲食控制。下列那個酵素的功能障礙，最可能是這個疾病的原因？
A. 胺甲醯磷酸鹽合成（carbamoyl phosphate synthetase）
B. 黑尿酸氧化（homogentisic acid oxidase）
C. 支鏈酮酸去氫酵素（branched-chain α-keto acid dehydrogenase）
D. 苯丙胺酸羥化（phenylalanine hydroxylase）

正確答案：C. 支鏈酮酸去氫酵素（branched-chain α-keto acid dehydrogenase）